Use of antidepressant medications or other psychotropic medications in the last 4 weeks (or the last 6 weeks for fluoxetine). Occasional use of benzodiazepines or non-benzodiazepine sedatives (such as zolpidem, eszopiclone, or zaleplon) during this period is allowable.

The above is a clinical trial exclusion criterion. Annotated with entity spans:
Use of [Drug: antidepressant medications] or [Qualifier: other] [Drug: psychotropic medications] [Temporal: in the last 4 weeks] (or the last 6 weeks for [Drug: fluoxetine]). [Multiplier: Occasional use] of [Drug: benzodiazepines] or [Drug: non-benzodiazepine sedatives] (such as [Drug: zolpidem], [Drug: eszopiclone], or [Drug: zaleplon]) during this period [Negation: is allowable].